Clinical trial exclusion criterion:
Undiagnosed vaginal bleeding.

Annotated entities:
- Condition: "vaginal bleeding"
- Qualifier: "Undiagnosed"